Which interleukin is blocked by Siltuximab?

Siltuximab is a monoclonal antibody that binds to interleukin-6 with high affinity and specificity.